20. Coexistent serious illnesses that would imply a drop-out before the end of the trial.

The above is a clinical trial exclusion criterion. Annotated with entity spans:
[Parsing_Error: 20.] [Undefined_semantics: Coexistent serious illnesses that would imply a drop-out before the end of the trial.]